Age >= 18

The above is a clinical trial inclusion criterion. Annotated with entity spans:
[Person: Age] [Value: >= 18]